Clinical trial exclusion criterion:
previous chemotherapy

Entity relations:
- Has_temporal("chemotherapy", "previous")